Clinical trial inclusion criterion:
Chest radiograph showing new opacities.

Annotated entities:
- Procedure: "Chest radiograph"
- Condition: "opacities"
- Qualifier: "new"